下列那一個病毒和腸道疾病無關？
A. 輪狀病毒（Rota viruses）
B. 挪瓦克病毒（Norwalk viruses）
C. 小 RNA 病毒（Picorna viruses）
D. 痘病毒（Pox viruses）

正確答案：D. 痘病毒（Pox viruses）